Known history of central nervous system damage (i.e. neoplasm, aneurysm, intracranial or spinal surgery) or recent trauma to the head or cranium (i.e. < 3 months)

The above is a clinical trial exclusion criterion. Annotated with entity spans:
Known history of [Condition: central nervous system damage] (i.e. [Condition: neoplasm], [Condition: aneurysm], [Procedure: intracranial] or [Procedure: spinal surgery]) or recent [Condition: trauma] to the [Qualifier: head] or [Qualifier: cranium] (i.e. [Temporal: < 3 months])